下列何種病毒的 DNA 可存在於卡波西氏肉瘤（Kaposi's sarcoma）的腫瘤組織中，而顯示其與此肉瘤的生成有關？
A. cytomegalovirus
B. human papilloma virus
C. human immunodeficiency virus
D. human herpesvirus 8（Kaposi's sarcoma-associated herpesvirus）

正確答案：D. human herpesvirus 8（Kaposi's sarcoma-associated herpesvirus）